Non-cardiac condition limiting life expectancy to less than one year, per physician judgment (e.g. cancer)

The above is a clinical trial inclusion criterion. Annotated with entity spans:
[Condition: Non-cardiac condition] limiting [Observation: life expectancy] to [Temporal: less than one year], per physician judgment (e.g. cancer)